List Mcl-1 inhibitors.

A-1210477
S63845